Clinical trial exclusion criterion:
Left ventricular ejection fraction <45%

Entity relations:
- Has_value("Left ventricular ejection fraction", "<45%")